Clinical trial exclusion criterion:
Urethral stricture or urethro-ileal maldirection

Annotated entities:
- Condition: "Urethral stricture"
- Condition: "urethro-ileal maldirection"